Clinical trial exclusion criterion:
4. vaginal bleeding or

Annotated entities:
- Condition: "vaginal bleeding"
- Parsing_Error: "or"